Clinical trial exclusion criterion:
Patients with significant bleeding disorder or liver disorder

Entity relations:
- Has_qualifier("bleeding disorder", "significant")
- OR("bleeding disorder", "liver disorder")